Clinical trial inclusion criterion:
BMI >18 and <35 kg/m2

Annotated entities:
- Measurement: "BMI"
- Value: ">18 and <35 kg/m2"